Significant risk of suicidal and/or self-harm behaviors

The above is a clinical trial exclusion criterion. Annotated with entity spans:
Significant [Mood: risk of] [Observation: suicidal] and/or [Observation: self-harm behaviors]